Clinical trial inclusion criterion:
4. Currently being treated for glaucoma using at least two medications, and be willing to continue on the same regime.

Entity relations:
- Has_temporal("treated", "Currently")
- AND("treated", "glaucoma")
- Has_multiplier("medications", "at least two")
- AND("treated", "medications")